Entre las complicaciones que presentan las personas que abusan del alcohol. Señale la opción FALSA:
1. Hipoglucemia.
2. Hiperglucemia.
3. Hipernatremia.
4. Hipercalcemia.

Respuesta correcta: 3. Hipernatremia.